Clinical trial exclusion criterion:
Non-infectious or autoimmune keratitis

Annotated entities:
- Condition: "autoimmune keratitis"
- Condition: "Non-infectious keratitis"